Clinical trial exclusion criterion:
Disseminated Intravascular Coagulation (DIC) attributable to heparin-induced thrombocytopenia.

Annotated entities:
- Condition: "Disseminated Intravascular Coagulation"
- Condition: "DIC"
- Condition: "heparin-induced thrombocytopenia"